Unwillingness or inability to comply with the procedures described in this protocol

The above is a clinical trial exclusion criterion. Annotated with entity spans:
[Post-eligibility: Unwillingness or inability to comply with the procedures described in this protocol]